32歲女性長期無月經，最近因打籃球時發生肋骨骨折，骨密度檢查T-score 為-2.8。病人曾於20歲時，因原發性無月經住院檢查，發現嗅覺不佳且子宮很小，因此曾服用口服避孕藥2年，之後因頭痛自行停藥。抽血檢查 LH＜0.8 IU/L, estradiol＜20 pg/mL。下列有關骨鬆症之治療何者最恰當？
A. bisphosphonate
B. estrogen
C. calcium + Vit D
D. human recombinant PTH

正確答案：B. estrogen